Clinical trial inclusion criterion:
Previously treated with ADASUVE® with a positive outcome (responders) according to (CGI-I) scale (defined as having a CGI-I score of 1 or 2 at 2 hours after administration of the inhalation)

Annotated entities:
- Drug: "ADASUVE"
- Measurement: "CGI-I score"
- Value: "1 or 2"
- Temporal: "2 hours after administration of the inhalation)"
- Reference_point: "administration of the inhalation)"